Clinical trial exclusion criterion:
Parasitic worm infection e.g. schistosomiasis, and hook worm by stool analysis.

Annotated entities:
- Condition: "Parasitic worm infection"
- Condition: "schistosomiasis"
- Condition: "hook worm"
- Procedure: "stool analysis"